下列抗癌藥中何者因可以和vascular endothelial growth factor（VEGF）結合，而抑制血管新生（angiogenesis），可作為治療metastatic colorectal cancer之藥物？
A. bevacizumab
B. cetuximab
C. gefitinib
D. imatinib

正確答案：A. bevacizumab